Clinical trial exclusion criterion:
Women under lactation and/or puerperium

Annotated entities:
- Person: "Women"
- Condition: "lactation"
- Condition: "puerperium"